Systemic treatment with aminosides in the last 15 days

The above is a clinical trial exclusion criterion. Annotated with entity spans:
[Procedure: Systemic treatment] with [Drug: aminosides] [Temporal: in the last 15 days]